alemtuzumab,

The above is a clinical trial exclusion criterion. Annotated with entity spans:
[Drug: alemtuzumab],